Clinical trial exclusion criterion:
Severely carious teeth resulting in inability to isolate for procedure

Entity relations:
- Has_qualifier("carious teeth", "Severely")
- causal("inability to isolate for procedure", "carious teeth")